Los síntomas cognitivos de la esquizofrenia se han relacionado fundamentalmente con:
1. Un aumento de la actividad en la corteza prefontal ventromedial.
2. Una disminución de la actividad en la corteza prefrontal dorsolateral.
3. Una hiperactividad en la vía dopaminérgica nigroestriada.
4. Una hiperactividad en la vía dopaminérgica mesolímbica.

Respuesta correcta: 2. Una disminución de la actividad en la corteza prefrontal dorsolateral.